有關傷口癒合的敘述，下列何者錯誤？
A. secondary healing 的疤痕較 primary healing 明顯
B. 傷口癒合三個步驟依順序為：inflammatory、maturational、proliferative
C. 血管新生（angiogenesis）是屬於 proliferative phase 的一個步驟
D. macrophages 和 neutrophils 在 inflammatory phase 扮演極重要的角色

正確答案：B. 傷口癒合三個步驟依順序為：inflammatory、maturational、proliferative